Clinical trial inclusion criterion:
Established diagnosis of UC and moderate-to-severe disease activity, defined as a Mayo score of 6-12, with an endoscopic subscore =2.

Entity relations:
- Has_value("Mayo score", "6-12")
- AND("Mayo score", "endoscopic subscore")
- Has_value("endoscopic subscore", "=2")
- Subsumes("moderate-to-severe", "Mayo score")
- Has_qualifier("UC", "moderate-to-severe")